Clinical trial inclusion criterion:
The patient and/or the patient's parent/legal guardian is willing and able to provide signed informed consent.

Annotated entities:
- Post-eligibility: "The patient and/or the patient's parent/legal guardian is willing and able to provide signed informed consent"